Clinical trial exclusion criterion:
2. Screening tool: Medical assessments (urine pregnancy test) at the beginning of each visit that involves TMS or MRI.

Annotated entities:
- Parsing_Error: "2."
- Measurement: "urine pregnancy test"
- Procedure: "Medical assessments"
- Temporal: "at the beginning of each visit"
- Reference_point: "the beginning of each visit"
- Procedure: "TMS"
- Procedure: "MRI"